Clinical trial inclusion criterion:
Optical coherence tomography central subfield thickness of at least 250 microns

Entity relations:
- Has_value("Optical coherence tomography central subfield thickness", "at least 250 microns")